下列何者為 2,4-dinitrophenol 抑制呼吸鏈（respiratory chain）之機制？
A. 抑制 ATP-ADP 交換（exchange）
B. 磷酸化反應與電子傳遞的解偶聯（uncoupling）
C. 抑制 ATP synthase 活性
D. 抑制電子的傳遞（electron transfer）

正確答案：B. 磷酸化反應與電子傳遞的解偶聯（uncoupling）